Clinical trial exclusion criterion:
current suicidal risk

Entity relations:
- Has_temporal("suicidal risk", "current")